Formal indication to oral anticoagulation beside atrial fibrillation (mechanic heart valves, recurrent thrombophlebitis, antiphospholipid syndrome)

The above is a clinical trial exclusion criterion. Annotated with entity spans:
Formal [Condition: indication] to [Drug: oral anticoagulation] beside [Condition: atrial fibrillation] ([Device: mechanic heart valves], [Condition: recurrent thrombophlebitis], [Condition: antiphospholipid syndrome])